下列何種檢驗常用來預測超急性排斥（hyperacute graft rejection）之發生與否？
A. 混合淋巴球反應（mixed lymphocyte reaction）
B. 免疫球蛋白（immunoglobulin）定量分析
C. 淋巴球表面標記（lymphocyte surface marker）分析
D. 既存抗體（preexisting antibody）偵測試驗

正確答案：D. 既存抗體（preexisting antibody）偵測試驗